the neurosurgeon aim at hearing preservation surgery and do not want to risk gentamicin associated hearing loss

The above is a clinical trial exclusion criterion. Annotated with entity spans:
[Non-representable: the neurosurgeon aim at hearing preservation surgery and do not want to risk gentamicin associated hearing loss]